Una valoración columbimétrica:
1. Se realiza siempre a potencial controlado.
2. Utiliza siempre un macroelectrodo de platino.
3. No necesita de un sistema indicador del punto final.
4. Necesita que la intensidad de corriente sea controlada.
5. Necesita siempre que el agente valorante se añada desde una bureta.

Respuesta correcta: 4. Necesita que la intensidad de corriente sea controlada.